En un paciente hospitalizado que no es capaz de alimentarse por vía oral durante más de 6 días, ¿en cuál de las situaciones clínicas siguientes hemos de usar necesariamente nutrición parenteral?
1. Ictus cardioembólico con disfagia neurológica completa.
2. Caquexia por empiema crónico en paciente inmunodeprimido.
3. Íleo paralítico prolongado.
4. Enfermedad de Alzheimer avanzada con grave riesgo de broncoaspiración.

Respuesta correcta: 3. Íleo paralítico prolongado.